2. Male or female ≥ 18 years of age.

The above is a clinical trial inclusion criterion. Annotated with entity spans:
2. [Person: Male] or [Person: female] [Value: ≥ 18 years] of [Person: age].